What is the function of STAR elements in yeast telomeres?

Subtelomeres also contain Sub-Telomeric Anti-silencing Regions (STARs).